下列何種藥物不具有利尿作用？
A. caffeine
B. captopril
C. interleukin-11
D. misoprostol

正確答案：C. interleukin-11